ECOG Performance status0-2

The above is a clinical trial inclusion criterion. Annotated with entity spans:
[Measurement: ECOG Performance status][Value: 0-2]